Clinical trial inclusion criteria:
singleton, term pregnancy
currently on buprenorphine maintenance therapy
scheduled for elective CD under spinal anesthesia

Annotated entities:
- Qualifier: "singleton"
- Qualifier: "term"
- Condition: "pregnancy"
- Drug: "buprenorphine"
- Procedure: "buprenorphine maintenance therapy"
- Temporal: "currently"
- Mood: "scheduled for"
- Qualifier: "elective"
- Procedure: "CD"
- Procedure: "spinal anesthesia"